一位高血壓病人，常有痛風發作，其他檢驗、檢查皆正常。在高血壓治療上，最應避免下列何種藥物？
A. 鈣離子阻斷劑
B. 利尿劑
C. 乙型交感神經阻斷劑（β-adrenergic receptor blocker）
D. Angiotensin receptor blocker（ARB）

正確答案：B. 利尿劑